Any condition other than coronary artery disease with a life expectancy <12 months

The above is a clinical trial exclusion criterion. Annotated with entity spans:
Any [Condition: condition] [Negation: other than] [Condition: coronary artery disease] with a [Observation: life expectancy] [Value: <12 months]